一位 60 歲女性有甲狀腺腫大病史數年，三個月前開始有心悸，甲狀腺右葉有一 3 cm 觸感堅實結 節，心電圖顯示心房震顫、驗血發現 free T4 1.9 ng/dL（normal range 0.8-1.8 ng/dL），T3 190 ng/dL
 （normal range 80-180 ng/dL），TSH＜0.2 μIU/mL（normal range 0.25-4.0 μIU/mL），甲促素（TSH）受體抗體陰性反應。下一步應該做什麼檢查來診斷甲狀腺功能異常之病因？
A. 甲狀腺超音波
B. 甲狀腺 I-131 掃描
C. 甲釋素刺激試驗（TRH stimulation test）
D. 18FDG 正子斷層攝影（18FDG-PET/CT）

正確答案：B. 甲狀腺 I-131 掃描